Clinical trial inclusion criteria:
Subject are at least 18 years of age
Subject has confirmed Pulmonary Hypertension and Interstitial Lung Disease
Subject are able to complete study procedures, such as spirometry, and Pulmonary Exercise test.

Annotated entities:
- Value: "at least 18 years"
- Person: "age"
- Condition: "Pulmonary Hypertension"
- Condition: "Interstitial Lung Disease"
- Mood: "confirmed"
- Procedure: "Pulmonary Exercise test"
- Procedure: "spirometry"
- Procedure: "study procedures"
- Undefined_semantics: "study procedures"